Clinical trial exclusion criterion:
22. Absolute neutrophil count <1500 mm3.

Annotated entities:
- Parsing_Error: "22."
- Measurement: "Absolute neutrophil count"
- Value: "<1500 mm3"